下列肺發育期間，呼吸細支氣管（respiratory bronchiole）何時出現？
A. 偽腺期（Pseudoglandular stage）
B. 小管期（Canalicular stage）
C. 末囊期（Terminal sac stage）
D. 肺泡期（Alveolar stage）

正確答案：B. 小管期（Canalicular stage）